How many copies of TP53 does the elephant genome contain?

The elephant genome encodes 20 copies of the tumor suppressor gene tp53 and that the evolution of large body sizes, the evolves of extreme sensitivity to genotoxic stress, and a hyperactive tp53 signaling pathway in the elephant (proboscidean) lineage have at least 20 copies (40 alleles), including 19 retrogenes (38 alleles) with evidence of transcriptional activity measured by reverse transcription polymerase chain reaction.